Which test is used to diagnose colour synesthesia?

Stroop-type testsWe